patients who underwent successful TAVI

The above is a clinical trial inclusion criterion. Annotated with entity spans:
patients who underwent [Qualifier: successful] [Procedure: TAVI]